Clinical trial exclusion criterion:
active infection

Annotated entities:
- Condition: "infection"
- Qualifier: "active"